Healthy patients (ASA I)

The above is a clinical trial inclusion criterion. Annotated with entity spans:
[Condition: Healthy patients] ([Measurement: ASA] [Value: I])